Clinical trial exclusion criterion:
Endogenous Cushing's

Entity relations:
- Has_qualifier("Cushing's", "Endogenous")